Clinical trial inclusion criterion:
Healthy adults 18-45 years of age

Annotated entities:
- Value: "18-45 years of age"
- Condition: "Healthy"
- Person: "adults"
- Person: "of age"